Por ozonolisis de un alquino seguida de hidrólisis, se forman dos:
1. Alcoholes.
2. Aldehídos.
3. Ácidos carboxílicos.
4. Cetonas.

Respuesta correcta: 3. Ácidos carboxílicos.